What micro-RNAs are useful in the diagnosis and prognosis of Heart Failure?

In particular, miR-214, miR-423-5p, appear to be promising for the diagnosis, prognosis and management of HF patients.